Advanced or distant metastatic stage,

The above is a clinical trial exclusion criterion. Annotated with entity spans:
[Value: Advanced] or [Value: distant metastatic] [Measurement: stage],